左側喉返神經會繞過下列何者再往上至喉部？
A. 主動脈弓
B. 頭臂動脈幹
C. 鎖骨下動脈
D. 頸總動脈

正確答案：A. 主動脈弓